Clinical trial inclusion criterion:
Patients who are 19 years or older on screening

Entity relations:
- Has_value("years", "19 or older")
- Has_index("on screening", "screening")
- Has_temporal("years", "on screening")